當吸菸者到醫院戒菸門診進行戒菸時，醫師評估發現吸菸者已有戒菸動機，故採用增強戒菸動機策略以堅定其戒菸的意願。此吸菸者是處於那一個戒菸階段？
A. 懵懂期（pre-contemplation phase）
B. 深思期（contemplation phase ）
C. 準備期（preparation phase）
D. 行動期（action phase）

正確答案：B. 深思期（contemplation phase ）